Asthma: Subjects with a current diagnosis of asthma. (Subjects with a prior history of asthma are eligible if they also have a current diagnosis of COPD).

The above is a clinical trial exclusion criterion. Annotated with entity spans:
[Condition: Asthma]: Subjects with a [Temporal: current] diagnosis of [Condition: asthma]. (Subjects with a [Temporal: prior] [Temporal: history] of [Condition: asthma] are eligible if they also have a current diagnosis of [Condition: COPD]).